從受傷或死亡的心肌細胞釋放於血液中某些成分可用於判定心肌梗塞的發生，下列蛋白質何者為心肌缺氧性損傷 具特異性的標示物質（biomarker）？
A. C-reactive protein
B. creatine kinase muscle dimer
C. lactate dehydrogenase
D. troponin T and troponin I

正確答案：D. troponin T and troponin I